5. Presence of evaluable (measureable or non-measurable) disease.

The above is a clinical trial inclusion criterion. Annotated with entity spans:
5. [Non-representable: Presence of evaluable (measureable or non-measurable) disease.]